Clinical trial inclusion criterion:
pregnant or lactating women,

Entity relations:
- OR("pregnant", "lactating")